15歲學生不幸摔車疑似造成上腹部器官挫傷，抱怨上腹部疼痛、心跳加快，若欲進行腹部影像評估是否有肝臟血管傷害出血，下列何者最為優先？
A. 血管攝影
B. 電腦斷層掃描
C. 磁振造影
D. 同位素肝臟掃描

正確答案：B. 電腦斷層掃描